在成人最常見的三尖瓣逆流（tricuspid regurgitation）原因為何？
A. 肺動脈高壓（pulmonary hypertension）
B. 類癌（carcinoid）
C. 愛伯斯坦氏異常（Ebstein's anomaly）
D. 心內膜炎（endocarditis）

正確答案：A. 肺動脈高壓（pulmonary hypertension）